Clinical trial exclusion criteria:
rearthroplasty
ASA IV-V
inadequate spoken finnish for reliable pain assessment
Dementia or otherwise impaired cognition
contraindication for any medication or substance used in survey protocol
weight <50kg or BMI =35 kg/m2
preoperative SpO2 less than 93%
clinical suspicion that subject can not use PCA adequately
history of substance abuse or current excessive use of alcohol
preoperative use of either pregabalin, gabapentin or strong opiates

Annotated entities:
- Procedure: "rearthroplasty"
- Measurement: "ASA"
- Value: "IV-V"
- Observation: "inadequate spoken finnish"
- Procedure: "reliable pain assessment"
- Condition: "Dementia"
- Condition: "impaired cognition"
- Condition: "contraindication"
- Drug: "medication used in survey protocol"
- Drug: "substance used in survey protocol"
- Measurement: "weight"
- Value: "<50kg"
- Measurement: "BMI"
- Value: "=35 kg/m2"
- Temporal: "preoperative"
- Measurement: "SpO2"
- Value: "less than 93%"
- Mood: "clinical suspicion"
- Observation: "subject can not use PCA adequately"
- Temporal: "history"
- Condition: "substance abuse"
- Temporal: "current"
- Condition: "excessive use of alcohol"
- Temporal: "preoperative"
- Drug: "pregabalin"
- Drug: "gabapentin"
- Drug: "strong opiates"